Clinical trial exclusion criterion:
Recent significant blood donation or plasma donation

Entity relations:
- Has_qualifier("blood donation", "significant")
- Has_temporal("blood donation", "Recent")
- OR("blood donation", "plasma donation")